Clinical trial exclusion criterion:
patients with immunodeficiency and malignant tumors during the treatment period, receiving immunosuppressive therapy (oral steroid) or HIV due to low immunity, or family members have congenital immune disease

Entity relations:
- Subsumes("immunosuppressive therapy", "oral steroid")
- Has_temporal("immunodeficiency", "during the treatment period")
- Has_context("congenital immune disease", "family members")
- OR("immunodeficiency", "malignant tumors")
- OR("immunosuppressive therapy", "HIV", "congenital immune disease")